Clinical trial exclusion criterion:
Mini-mental State Examination (MMSE) [18] score = 23.

Entity relations:
- Has_value("Mini-mental State Examination (MMSE)", "= 23")